contraindication for any medication or substance used in survey protocol

The above is a clinical trial exclusion criterion. Annotated with entity spans:
[Condition: contraindication] for any [Drug: medication] or [Drug: substance used in survey protocol]